have an organic brain disease

The above is a clinical trial exclusion criterion. Annotated with entity spans:
have an [Condition: organic brain disease]